Clinical trial exclusion criterion:
Patients with any macular changes prior to the surgery (epiretinal membranes, age macular disease, macular edema...)

Annotated entities:
- Condition: "macular changes"
- Qualifier: "any"
- Temporal: "prior to the surgery"
- Reference_point: "the surgery"
- Procedure: "surgery"
- Condition: "epiretinal membranes"
- Condition: "age macular disease"
- Condition: "macular edema"